Documented or suspected family or personal history of malignant hyperthermia.

The above is a clinical trial exclusion criterion. Annotated with entity spans:
Documented or suspected family or [Temporal: personal history] of [Condition: malignant hyperthermia].